Clinical trial inclusion criterion:
5. Estimated IQ greater than or equal to 85

Annotated entities:
- Parsing_Error: "5."
- Measurement: "Estimated IQ"
- Value: "greater than or equal to 85"